Clinical trial exclusion criterion:
HOMA IR< 2.0

Annotated entities:
- Measurement: "HOMA IR"
- Value: "< 2.0"